一位未婚的32歲媽媽產下一個唇顎裂男嬰，需要母親學習以大洞奶嘴餵食嬰兒，將來須進行數次手術矯正，然而，醫護人員發現這位產婦是個吸毒患者，沒有職業，嬰兒生父不詳，而嬰兒的外祖父母亦拒絕擔負撫養責任，下列何者是最佳的處置？
A. 歸給母親撫養
B. 強制嬰兒的外祖父母撫養
C. 尋求社福機構協助
D. 交由法院判定

正確答案：C. 尋求社福機構協助